Clinical trial exclusion criterion:
Severe hepatic dysfunction (> 3 times normal reference values)

Entity relations:
- Has_qualifier("hepatic dysfunction", "Severe")